Clinical trial inclusion criterion:
Woman who had 2 miscarriage before 12(th) week of gestation.The patient who is diagnosed as thrombophilia with recurrent pregnancy loss. Signed consent form.

Entity relations:
- Has_index("before 12(th) week of gestation", "12(th) week of gestation")
- multi("before 12(th) week of gestation", "before 12(th) week of gestation")
- Has_qualifier("miscarriage", "before 12(th) week of gestation")
- Has_multiplier("miscarriage", "2")
- Has_multiplier("pregnancy loss", "recurrent")
- AND("thrombophilia", "pregnancy loss")